Clinical trial exclusion criterion:
Known hypersensitivity to paracetamol or mannitol (excipient with known effect)

Annotated entities:
- Condition: "hypersensitivity"
- Drug: "paracetamol"
- Drug: "mannitol"
- Non-representable: "(excipient with known effect)"